Clinical trial inclusion criteria:
Infertile women with eugonadotrophic anovulation/oligoovulation.
Unexplained infertility.

Annotated entities:
- Person: "women"
- Condition: "Infertile"
- Condition: "anovulation"
- Condition: "oligoovulation"
- Qualifier: "eugonadotrophic"
- Qualifier: "Unexplained"
- Condition: "infertility"